Clinical trial exclusion criterion:
10. History of any medical or psychiatric condition or laboratory abnormality that, in the opinion of the investigator, may increase the risks associated with the study participation or administration of the investigational products, or that may interfere with the interpretation of the results.

Annotated entities:
- Condition: "psychiatric condition"
- Condition: "laboratory abnormality"
- Procedure: "laboratory"
- Post-eligibility: "History of any medical or psychiatric condition or laboratory abnormality that, in the opinion of the investigator, may increase the risks associated with the study participation or administration of the investigational products, or that may interfere with the interpretation of the results."